Clinical trial inclusion criterion:
Based on single or averaged corrected QT interval (QTc) values of triplicate electrocardiograms obtained over a brief recording period: QTcF < 450 msec

Entity relations:
- Has_value("QTcF", "< 450 msec")
- Has_temporal("electrocardiograms", "over a brief recording period")
- Subsumes("corrected QT interval (QTc)", "QTcF")
- Has_value("corrected QT interval (QTc)", "< 450 msec")
- Has_qualifier("corrected QT interval (QTc)", "single")
- Has_qualifier("QTcF", "single")
- AND("corrected QT interval (QTc)", "electrocardiograms")
- AND("QTcF", "electrocardiograms")
- OR("single", "averaged")